What is the color of the protein Ranasmurfin?

Ranasmurfin is a blue protein.